Clinical trial exclusion criterion:
Posterior segment diseases requiring a treatment or threatening the visual prognosis

Entity relations:
- Has_mood("treatment", "requiring")
- AND("Posterior segment diseases", "treatment")
- OR("treatment", "threatening the visual prognosis")